Having the other contraindications for Rosuvastatin;

The above is a clinical trial exclusion criterion. Annotated with entity spans:
Having the other [Condition: contraindications] for [Drug: Rosuvastatin];